Clinical trial inclusion criterion:
Subjects fluent in English or when not fluent, an appropriate translator is present

Annotated entities:
- Post-eligibility: "Subjects fluent in English or when not fluent, an appropriate translator is present"